黴漿菌（Mycoplasma）與 L form 細菌同樣都缺乏細胞壁結構，其二者最大的差異為何？
A. 黴漿菌細胞膜上含有固醇，而 L form 細菌則無
B. L form 細菌細胞膜上含有固醇，而黴漿菌則無
C. 在適當的生長條件下，黴漿菌可形成細胞壁結構，而 L form 細菌則否
D. 黴漿菌對 β-lactam 類藥物敏感，而 L form 細菌則有抗性

正確答案：A. 黴漿菌細胞膜上含有固醇，而 L form 細菌則無